At least one sign of RV pressure overload/dysfunction on CT angiography or echocardiography

The above is a clinical trial inclusion criterion. Annotated with entity spans:
[Multiplier: At least one] [Condition: sign of RV pressure overload]/dysfunction on [Procedure: CT angiography] or [Procedure: echocardiography]